Clinical trial exclusion criterion:
Ongoing cord compression or a syrinx in the spinal cord or who suffer from a spinal cord disease such as spinal stenosis, spina bifida, MS, or herniated disk

Entity relations:
- Has_qualifier("syrinx", "spinal cord")
- Subsumes("spinal cord disease", "spinal stenosis")
- OR("spinal stenosis", "MS", "spina bifida", "herniated disk")
- OR("cord compression", "spinal cord disease", "syrinx")